currently pregnant, or trying to become pregnant

The above is a clinical trial exclusion criterion. Annotated with entity spans:
[Temporal: currently] [Condition: pregnant], or [Mood: trying to become] [Condition: pregnant]